Clinical trial exclusion criterion:
History of nephrolithiasis

Annotated entities:
- Condition: "nephrolithiasis"
- Temporal: "History"